下列何者是視神經炎（optic neuritis）最常見的視野變化？
A. 盲點（blind spot）變大
B. 中心盲點（central scotoma）
C. 雙顳側半盲（bitemporal hemianopsia）
D. 接融處盲點（junctional scotoma）

正確答案：B. 中心盲點（central scotoma）